Clinical trial inclusion criterion:
Patients must have a Zubrod performance status of 0-2.

Annotated entities:
- Measurement: "Zubrod performance status"
- Value: "0-2"